棘白菌素（Echinocandins）是一類較新的抗真菌（antifungal）藥物，其中一種卡泊芬淨（Caspofungin）已通過人體試	供臨床使用。其抑制真菌之機轉為何？
A. 抑制真菌DNA之合成
B. 抑制真菌麥角固醇（ergosterol）之合成
C. 抑制真菌1,3-β-葡聚醣（1,3-β-glucans）之合成
D. 抑制真菌幾丁質（chitin）之合成

正確答案：C. 抑制真菌1,3-β-葡聚醣（1,3-β-glucans）之合成